3. Etiology: The insult to the central nervous system that caused the motor dysfunction must have occurred during gestation or within one year after birth independent of gestational age.

The above is a clinical trial inclusion criterion. Annotated with entity spans:
[Parsing_Error: 3.] [Non-query-able: Etiology: The insult to the central nervous system that caused the motor dysfunction must have occurred during gestation or within one year after birth independent of gestational age.]